Clinical trial inclusion criteria:
Uncomplicated RYGB performed minimum 3 months prior to the study.
Fasting plasma glucose < 7,0 mM, HbA1c < 48 mmol/mol 3 months after RYGB

Annotated entities:
- Procedure: "RYGB"
- Qualifier: "Uncomplicated"
- Temporal: "minimum 3 months prior to the study"
- Reference_point: "the study"
- Measurement: "Fasting plasma glucose"
- Value: "< 7,0 mM"
- Measurement: "HbA1c"
- Value: "< 48 mmol/mol"
- Temporal: "3 months after RYGB"
- Reference_point: "RYGB"
- Procedure: "RYGB"